Clinical trial exclusion criterion:
Patient with contra-indication to: dipyridamole, aminophylline, dobutamine or exercise stress test (depending on the method of cardiovascular stress test chosen)

Entity relations:
- Subsumes("contra-indication", "dipyridamole")
- OR("dipyridamole", "aminophylline", "dobutamine", "exercise stress test")